下列那一種RNA聚合酶（RNA polymerase）對α-amanitin最敏感？
A. RNA polymerase I
B. RNA polymerase II
C. RNA polymerase III
D. reverse transcriptase

正確答案：B. RNA polymerase II